病人於接受心臟手術後，轉入加護病房觀察。此時他的血壓由術後的140/80 mmHg 下降至80/60 mmHg，肺動脈壓由 30/18 mmHg上升至56/30 mmHg，肺楔壓為20 mmHg，中心靜脈壓為15 mmHg，心跳為130/min。下列立即處置何者適當？①給予血管放鬆劑，	低後負荷 ②給予抗心律不整藥，改善心跳過速 ③給予裝置葉克膜 (ECMO) ④給予強心劑，增強心肌收縮力
A. ①②③
B. 僅①③
C. ②④
D. 僅④

正確答案：D. 僅④